Patients that are high risk for moderate exercise based on ACSM risk classification.

The above is a clinical trial exclusion criterion. Annotated with entity spans:
Patients that are [Value: high] [Measurement: risk for moderate exercise] based on [Measurement: ACSM risk classification].